Weight <50 kg

The above is a clinical trial exclusion criterion. Annotated with entity spans:
[Person: Weight] [Value: <50 kg]